Clinical trial inclusion criterion:
3. Subject and/or guardian must be able to provide informed consent.

Annotated entities:
- Non-query-able: "Subject and/or guardian must be able to provide informed consent."
- Post-eligibility: "Subject and/or guardian must be able to provide informed consent."